Clinical trial inclusion criterion:
signed informed consent.

Annotated entities:
- Informed_consent: "signed informed consent"